Clinical trial exclusion criterion:
Esophageal stenosis preventing the passage of an endoscope,

Entity relations:
- multi("passage of an endoscope", "endoscope")
- Has_mood("passage of an endoscope", "preventing the")
- AND("Esophageal stenosis", "passage of an endoscope")